淋病球菌（gonococci）感染成年婦女，最常起始於下列那個部位？
A. 尿道
B. 陰道
C. 子宮頸
D. 輸卵管

正確答案：C. 子宮頸